Clinical trial exclusion criterion:
Pediatric patients (under 18 years) Pregnancy Patients who are unresponsive at baseline, who have neurologic deficits at baseline, or who are allergic to dexmedetomidine

Entity relations:
- Has_value("years", "under 18 years")
- Subsumes("Pediatric", "years")
- AND("allergic", "dexmedetomidine")
- Has_temporal("neurologic deficits", "at baseline")
- Has_temporal("unresponsive", "at baseline")
- OR("unresponsive", "neurologic deficits", "allergic")